Clinical trial exclusion criterion:
breastfeeding

Annotated entities:
- Observation: "breastfeeding"